Currently participating in any other clinical research study.

The above is a clinical trial exclusion criterion. Annotated with entity spans:
[Competing_trial: Currently participating in any other clinical research study.]